Clinical trial inclusion criterion:
indication to surgery (symptoms of menometrorrhagia,

Entity relations:
- Has_mood("surgery", "indication to")
- Subsumes("surgery", "menometrorrhagia")